Clinical trial exclusion criterion:
Undergoing Interleukin-2 (IL-2) therapy within 8 weeks of study entry

Annotated entities:
- Procedure: "Interleukin-2 (IL-2) therapy"
- Temporal: "within 8 weeks of study entry"